Clinical trial exclusion criterion:
failure to advance the IVUS catheter through the culprit lesion;

Annotated entities:
- Device: "IVUS catheter"
- Procedure: "advance the IVUS catheter"
- Qualifier: "failure"
- Qualifier: "culprit lesion"